Clinical trial inclusion criterion:
At the time of Visit 1, there is a plan to initiate IV antibiotics for a pulmonary exacerbation

Entity relations:
- AND("IV antibiotics", "pulmonary exacerbation")
- Has_index("At the time of Visit 1", "Visit 1")
- Has_temporal("IV antibiotics", "At the time of Visit 1")